Molar teeth

The above is a clinical trial exclusion criterion. Annotated with entity spans:
[Condition: Molar teeth]